一位有長期吸菸病史及罹患 COPD 之 60 歲病患，一個月前因肺炎入院，經胸腔內科醫師診治，現病情穩定好轉，會診復健科，經診視，病患有 barrel chest，張口吸氣且腹肌同時用力，有 productive cough 且有 dyspnea。下列那種呼吸方式最能改善病患肺氣腫之情形？
A. 圓唇吐氣（pursed-lip expiration）
B. 舌咽呼吸（glossopharyngeal breathing）
C. 胸式呼吸
D. 淺而快速之呼吸

正確答案：A. 圓唇吐氣（pursed-lip expiration）